Clinical trial exclusion criterion:
allergies to any medications used in the study

Entity relations:
- AND("allergies", "medications used in the study")